Which syndrome is associated to SAMHD1 gene mutations?

Mutations in the SAMHD1 gene that cause the severe autoimmune disease, Aicardi-Goutieres syndrome (AGS).